李先生，75歲，有高血壓、糖尿病病史，因突發性右側肢體乏力，兩側眼球偏轉到左側，合併意識障礙而住院診治。如果李先生是腦梗塞患者，下列何者正確？
A. 是右側中大腦動脈區梗塞
B. 腦水腫（edema）在梗塞後第1天最嚴重，3天後慢慢緩解
C. 病人是小血管小洞性梗塞（small-vessel lacunar infarction）
D. 預測病人預後不佳，有高死亡率

正確答案：D. 預測病人預後不佳，有高死亡率